Clinical trial exclusion criterion:
Concurrent severe medical problems unrelated to the malignancy which would limit full compliance with the study.

Annotated entities:
- Temporal: "Concurrent"
- Qualifier: "severe"
- Condition: "medical problems"
- Qualifier: "limit full compliance with the study"
- Qualifier: "unrelated to the malignancy"
- Condition: "malignancy"